Clinical trial exclusion criterion:
1. History or presence of allergy to the study drugs or their components or drugs of their class, or a history of drug or other allergy that, in the opinion of the physician responsible, contraindicates their participation

Annotated entities:
- Parsing_Error: "1."
- Condition: "allergy"
- Drug: "study drugs"
- Context_Error: "study drugs"
- Subjective_judgement: "History or presence of allergy to the study drugs or their components or drugs of their class, or a history of drug or other allergy that, in the opinion of the physician responsible, contraindicates their participation"
- Non-query-able: "History or presence of allergy to the study drugs or their components or drugs of their class, or a history of drug or other allergy that, in the opinion of the physician responsible, contraindicates their participation"